接受過骨水泥式全髖人工關節置換術無併發症的病人，手術後最早何時可以開始進行患側肢體的重量承載訓練？
A. 1 天內
B. 1 個星期
C. 1 個月
D. 3 個月

正確答案：A. 1 天內